下列那兩種荷爾蒙之間的分泌屬於正迴饋調控？
A. 副甲狀腺素與降鈣素
B. 排卵前動情素（estrogen）與促黃體素（LH）
C. 助孕酮（progesterone）與促濾泡素（FSH）
D. 皮質醇（cortisol）與促腎上腺皮質素（ACTH）

正確答案：B. 排卵前動情素（estrogen）與促黃體素（LH）